Person is a unilateral transfemoral or knee-disarticulation amputee with stabilized residual limb.

The above is a clinical trial inclusion criterion. Annotated with entity spans:
[Non-query-able: Person is a unilateral transfemoral or knee-disarticulation amputee with stabilized residual limb].